Clinical trial exclusion criteria:
Primary groups: Vaccination against typhoid fever within 5 years before dosing.
History of clinical typhoid fever, clinical paratyphoid A or B fever.
Immunization with any other vaccine (oral or parenteral) within 4 weeks prior to study start or planned vaccination during the study
Current intake of antibiotics or end of antibiotic therapy <8 days before first IMP administration
Chronic (longer than 14 days) administration of immunosuppressants or other immune-modifying drugs within 6 months before the first dose of investigational vaccine; oral corticosteroids in dosages of =0.5 mg/kg/d prednisolone or equivalent are excluded; inhaled or topical steroids are allowed
Acute or chronic clinically significant gastrointestinal disease

Annotated entities:
- Observation: "Primary groups"
- Procedure: "Vaccination against typhoid fever"
- Condition: "typhoid fever"
- Temporal: "within 5 years before dosing"
- Reference_point: "dosing"
- Temporal: "History"
- Condition: "clinical typhoid fever"
- Condition: "clinical paratyphoid A fever"
- Condition: "clinical paratyphoid B fever"
- Procedure: "Immunization with vaccine"
- Qualifier: "any other"
- Qualifier: "oral"
- Qualifier: "parenteral"
- Temporal: "within 4 weeks prior to study start"
- Reference_point: "study start"
- Mood: "planned"
- Procedure: "vaccination"
- Temporal: "during the study"
- Reference_point: "the study"
- Drug: "antibiotics"
- Temporal: "Current"
- Multiplier: "end of"
- Procedure: "antibiotic therapy"
- Temporal: "<8 days before first IMP administration"
- Reference_point: "first IMP administration"
- Multiplier: "Chronic administration"
- Multiplier: "longer than 14 days"
- Drug: "immunosuppressants"
- Drug: "immune-modifying drugs"
- Qualifier: "other"
- Temporal: "within 6 months before the first dose of investigational vaccine"
- Reference_point: "the first dose of investigational vaccine"
- Drug: "investigational vaccine"
- Drug: "oral corticosteroids"
- Multiplier: "dosages"
- Value: "=0.5 mg/kg/d"
- Negation: "excluded"
- Qualifier: "prednisolone or equivalent"
- Non-representable: "inhaled or topical steroids are allowed"
- Qualifier: "clinically significant"
- Condition: "gastrointestinal disease"
- Qualifier: "Acute"
- Qualifier: "chronic"